Clinical trial exclusion criterion:
Patients who are recipients of multiple solid organ or islet cell tissue transplants, or have previously received an organ or tissue transplant. Patients who have a combined liver-kidney transplant.

Entity relations:
- Has_multiplier("solid organ transplants", "multiple")
- Has_temporal("organ transplant", "previously")
- OR("solid organ transplants", "islet cell tissue transplants")
- OR("organ transplant", "tissue transplant")
- OR("solid organ transplants", "organ transplant", "combined liver-kidney transplant")